Clinical trial exclusion criterion:
Major bleeding history within prior 2 months

Annotated entities:
- Condition: "Major bleeding history"
- Temporal: "within prior 2 months"